Clinical trial exclusion criterion:
Known hypersensitivity to chloroprocaine (a.k.a. Ester allergy), paraaminobenzoic acid (PABA) or bupivacaine (a.k.a. Amide allergy)

Entity relations:
- Subsumes("paraaminobenzoic acid", "PABA")
- AND("hypersensitivity", "chloroprocaine")
- Subsumes("hypersensitivity", "Ester allergy")
- Subsumes("hypersensitivity", "Amide allergy")
- OR("chloroprocaine", "paraaminobenzoic acid", "bupivacaine")